Clinical diagnosis associated with increased risk of bleeding including known active peptic ulceration and/or neoplasm with increased bleeding risk

The above is a clinical trial exclusion criterion. Annotated with entity spans:
Clinical diagnosis associated with [Qualifier: increased] [Observation: risk of bleeding] including known [Qualifier: active] [Condition: peptic ulceration] and/or [Condition: neoplasm] with increased bleeding risk